Creatinine clearance more or equal to 30 mL/min

The above is a clinical trial inclusion criterion. Annotated with entity spans:
[Measurement: Creatinine clearance] [Value: more or equal to 30 mL/min]